下列有關間皮瘤（mesothelioma）的敘述，何者錯誤？
A. 可由壁層胸膜或臟層胸膜發生
B. 可見上皮樣或肉瘤樣之腫瘤細胞型態
C. 腫瘤細胞通常表現Calretinin
D. 大多數病患發生腫瘤時，肺部通常同時發生石棉肺纖維化（asbestosis fibrosis）

正確答案：D. 大多數病患發生腫瘤時，肺部通常同時發生石棉肺纖維化（asbestosis fibrosis）